①額神經（frontal nerve） ②鼻睫神經（nasociliary nerve） ③動眼神經（oculomotor nerve） ④淚神經（lacrimal nerve） ⑤滑車神經（trochlear nerve） ⑥外旋神經（abducent nerve）等六條神經中，那些不經由總腱環（common tendinous ring）內進出眼眶？
A. ①③⑤
B. ②③⑥
C. ②④⑥
D. ①④⑤

正確答案：D. ①④⑤